CHADS2 score = 2 or CHA2DS2-VASc score (=3)

The above is a clinical trial inclusion criterion. Annotated with entity spans:
[Measurement: CHADS2 score] [Value: = 2] or [Measurement: CHA2DS2-VASc score] ([Value: =3])